下列有關梅克耳憩室（Meckel diverticulum）的敘述，何者正確？
A. 位置距離迴盲瓣（ileocecal valve）2 英吋
B. 出血症狀多半發生在 3 到 6 歲間
C. 內含的異位組織最常見的是胃及腎臟組織
D. 是引起腸套疊（intussusception）的常見導引點（lead point）

正確答案：D. 是引起腸套疊（intussusception）的常見導引點（lead point）